Clinical trial inclusion criterion:
Primary Sjögren's syndrome with the diagnosis made by the American-European criteria.

Entity relations:
- Has_qualifier("Primary Sjögren's syndrome", "American-European criteria")